Identical HLA patients

The above is a clinical trial exclusion criterion. Annotated with entity spans:
[Condition: Identical HLA] patients